Patient provides written informed consent.

The above is a clinical trial inclusion criterion. Annotated with entity spans:
[Informed_consent: Patient provides written informed consent].